Clinical trial inclusion criterion:
At least an average of 4 seizures/week in baseline period.

Entity relations:
- Has_multiplier("seizures", "At least an average of 4 /week")